Clinical trial exclusion criteria:
Is currently participating or has participated in a study with an investigational agent or using an investigational device within 4 weeks of the first dose of study medication
Has received sorafenib or oxaliplatin-based chemotherapy within 14 days of first dose of study medication
Has had esophageal or gastric variceal bleeding within the last 6 months
Has clinically apparent ascites on physical examination
Has portal vein invasion at the main portal branch (Vp4), inferior vena cava, or cardiac involvement of HCC based on imaging
Has had clinically diagnosed hepatic encephalopathy in the last 6 months
Has had a solid organ or hematologic transplant
Has had prior systemic therapy for HCC in the advanced (incurable) setting other than sorafenib or oxaliplatin-based chemotherapy, prior to start of study medication
Has an active autoimmune disease that has required systemic treatment in the past 2 years. Replacement therapy is not considered a form of systemic treatment.
Has a diagnosis of immunodeficiency or is receiving systemic steroid therapy or any other form of immunosuppressive therapy within 7 days prior to the first dose of study medication
Has received locoregional therapy to liver (transcatheter chemoembolization [TACE], transcatheter embolization [TAE], hepatic arterial infusion [HAI], radiation, radioembolization, or ablation) or other site within 4 weeks prior to the first dose of study medication
Has had major surgery to liver or other site within 4 weeks prior to the first dose of study medication
Has had a minor surgery ≤7 days prior to the first dose of study medication
Has not recovered adequately (i.e., Grade ≤1 or baseline) from the toxicity and/or complications from any intervention prior to study start
Has a diagnosed additional malignancy within 3 years prior to first dose of study medication with the exception of curatively treated basal cell carcinoma of the skin, squamous cell carcinoma of the skin and/or curatively resected in situ cancers
Has a known history of, or any evidence of, central nervous system (CNS) metastases and/or carcinomatous meningitis
Has a history of (non-infectious) pneumonitis that required steroids or current pneumonitis
Has an active infection requiring systemic therapy
Is pregnant or breast feeding or expecting to conceive or father starting from the first dose of study medication, throughout the study period, and for up to 120 days after the last dose of study medication
Has received prior immunotherapy with an anti-Programmed Cell Death Receptor 1 (PD-1), Programmed Cell Death Receptor Ligand 1 (anti-PD-L1), or anti- Programmed Cell Death Receptor Ligand 2 (PD-L2) or has previously participated in clinical studies with pembrolizumab
Has a known history of human immunodeficiency virus (HIV)
Has untreated active Hepatitis B
Has hepatitis C in which participants received therapy for HCV <4 weeks prior to receiving pembrolizumab
Has received a live vaccine within 30 days prior to the first dose of study therapy

Annotated entities:
- Non-query-able: "Is currently participating or has participated in a study with an investigational agent or using an investigational device within 4 weeks of the first dose of study medication"
- Drug: "sorafenib"
- Drug: "oxaliplatin"
- Procedure: "chemotherapy"
- Qualifier: "sorafenib or oxaliplatin-based"
- Temporal: "within 14 days"
- Reference_point: "first dose of study medication"
- Condition: "esophageal variceal bleeding"
- Condition: "gastric variceal bleeding"
- Temporal: "within the last 6 months"
- Condition: "ascites"
- Condition: "portal vein invasion"
- Qualifier: "main portal branch (Vp4)"
- Qualifier: "inferior vena cava"
- Condition: "cardiac involvement"
- Condition: "HCC"
- Procedure: "imaging"
- Condition: "hepatic encephalopathy"
- Temporal: "in the last 6 months"
- Procedure: "hematologic transplant"
- Procedure: "solid organ transplant"
- Procedure: "systemic therapy"
- Condition: "HCC"
- Drug: "sorafenib"
- Drug: "oxaliplatin"
- Procedure: "chemotherapy"
- Qualifier: "sorafenib or oxaliplatin-based"
- Temporal: "prior"
- Reference_point: "start of study medication"
- Negation: "other than"
- Temporal: "active"
- Condition: "autoimmune disease"
- Procedure: "systemic treatment"
- Temporal: "in the past 2 years"
- Not_a_criteria: "Replacement therapy is not considered a form of systemic treatment."
- Condition: "immunodeficiency"
- Procedure: "systemic steroid therapy"
- Procedure: "immunosuppressive therapy"
- Temporal: "within 7 days prior"
- Reference_point: "the first dose of study medication"
- Procedure: "locoregional therapy"
- Procedure: "transcatheter chemoembolization [TACE]"
- Procedure: "transcatheter embolization [TAE]"
- Procedure: "hepatic arterial infusion [HAI]"
- Procedure: "radiation"
- Procedure: "radioembolization"
- Procedure: "ablation"
- Temporal: "within 4 weeks prior"
- Reference_point: "first dose of study medication"
- Qualifier: "liver"
- Qualifier: "other site"
- Procedure: "major surgery"
- Qualifier: "liver"
- Qualifier: "other site"
- Temporal: "within 4 weeks prior"
- Reference_point: "first dose of study medication"
- Procedure: "minor surgery"
- Temporal: "≤7 days prior"
- Reference_point: "first dose of study medication"
- Undefined_semantics: "Has not recovered adequately (i.e., Grade ≤1 or baseline) from the toxicity and/or complications from any intervention prior to study start"
- Context_Error: "Has not recovered adequately (i.e., Grade ≤1 or baseline) from the toxicity and/or complications from any intervention prior to study start"
- Subjective_judgement: "recovered adequately"
- Condition: "malignancy"
- Qualifier: "additional"
- Temporal: "within 3 years prior to first dose of study medication"
- Reference_point: "first dose of study medication"
- Procedure: "treated"
- Qualifier: "curatively"
- Undefined_semantics: "curatively treated"
- Condition: "basal cell carcinoma of the skin"
- Condition: "squamous cell carcinoma of the skin"
- Condition: "in situ cancers"
- Procedure: "resected"
- Qualifier: "curatively"
- Qualifier: "curatively treated"
- Qualifier: "curatively resected"
- Negation: "with the exception of"
- Temporal: "history"
- Observation: "evidence"
- Condition: "central nervous system (CNS) metastases"
- Condition: "carcinomatous meningitis"
- Drug: "steroids"
- Drug: "pneumonitis"
- Temporal: "current"
- Temporal: "history"
- Condition: "non-infectious) pneumonitis"
- Procedure: "systemic therapy"
- Temporal: "active"
- Condition: "infection"
- Qualifier: "requiring systemic therapy"
- Condition: "pregnant"
- Observation: "breast feeding"
- Observation: "expecting to conceive"
- Observation: "expecting to father"
- Temporal: "starting from the first dose of study medication"
- Reference_point: "the first dose of study medication"
- Temporal: "throughout the study period"
- Reference_point: "the study period"
- Temporal: "for up to 120 days after the last dose of study medication"
- Reference_point: "the last dose of study medication"
- Procedure: "immunotherapy"
- Drug: "anti-Programmed Cell Death Receptor 1 (PD-1)"
- Drug: "Programmed Cell Death Receptor Ligand 1 (anti-PD-L1)"
- Drug: "anti- Programmed Cell Death Receptor Ligand 2 (PD-L2)"
- Non-query-able: "participated in clinical studies with pembrolizumab"
- Drug: "pembrolizumab"
- Observation: "participated in clinical studies with pembrolizumab"
- Condition: "human immunodeficiency virus (HIV)"
- Temporal: "history"
- Condition: "Hepatitis B"
- Qualifier: "untreated"
- Qualifier: "active"
- Condition: "hepatitis C"
- Procedure: "therapy for HCV"
- Temporal: "<4 weeks prior"
- Drug: "pembrolizumab"
- Reference_point: "receiving pembrolizumab"
- Condition: "live vaccine"
- Temporal: "30 days prior"
- Reference_point: "first dose of study therapy"